Clinical trial exclusion criterion:
Current use of Triptans (5HT1 Agonists)

Entity relations:
- Subsumes("Triptans", "5HT1 Agonists")